Clinical trial inclusion criterion:
American Society of Anesthesiologists physical status class I-III

Annotated entities:
- Measurement: "American Society of Anesthesiologists physical status"
- Value: "class I-III"